Clinical trial inclusion criterion:
Primary knee osteoarthritis diagnosed using the American College of Rheumatology criteria (46)

Annotated entities:
- Condition: "Primary knee osteoarthritis"
- Qualifier: "American College of Rheumatology criteria"